Clinical trial inclusion criterion:
No significant disease or drug use

Annotated entities:
- Condition: "drug use"
- Condition: "disease"
- Qualifier: "significant"
- Subjective_judgement: "significant"
- Negation: "No"